Evidence of the acquisition of HCV at the time of or after transplantation

The above is a clinical trial exclusion criterion. Annotated with entity spans:
Evidence of the [Condition: acquisition of HCV] [Temporal: at the time of or after transplantation]